Clinical trial exclusion criterion:
Lower limb surgery preceding year

Annotated entities:
- Procedure: "Lower limb surgery"